Clinical trial inclusion criterion:
Insufficient knowledge of German

Annotated entities:
- Observation: "Insufficient knowledge of German"